下列何者構成坐骨肛門窩（ischioanal fossa）的內側壁？
A. 臀中肌
B. 提肛肌
C. 梨狀肌
D. 閉孔內肌

正確答案：B. 提肛肌